Women with previous radiation above the diaphragm, and below the neck

The above is a clinical trial exclusion criterion. Annotated with entity spans:
[Person: Women] with [Qualifier: previous] [Procedure: radiation] [Qualifier: above the diaphragm], and [Qualifier: below the neck]